ejection fraction = 30%

The above is a clinical trial inclusion criterion. Annotated with entity spans:
[Measurement: ejection fraction] [Value: = 30%]